Describe the mechanism of action of pitolisant.

Pitolisant is an antagonist/inverse agonist of the human histamine H3 receptor. It is used for treatment of narcolepsy.